Clinical trial exclusion criterion:
Surgery to the treated limb less than 6 months previously.

Annotated entities:
- Procedure: "Surgery"
- Qualifier: "treated limb"
- Temporal: "less than 6 months"